Clinical trial exclusion criterion:
Presence of significant cardiac disease (history of unstable ischemic heart disease, heart failure, severe and uncontrolled hypertension) that, in the opinion of the investigator, would put the patient at risk of a clinically significant arrhythmia or myocardial infarction

Annotated entities:
- Condition: "cardiac disease"
- Qualifier: "significant"
- Condition: "unstable ischemic heart disease"
- Condition: "heart failure"
- Qualifier: "severe"
- Qualifier: "uncontrolled"
- Condition: "hypertension"
- Temporal: "history"
- Qualifier: "clinically significant"
- Condition: "arrhythmia"
- Condition: "myocardial infarction"
- Mood: "at risk of"